Clinical trial exclusion criterion:
Patient refusal to provide informed consent.

Annotated entities:
- Post-eligibility: "Patient refusal to provide informed consent"